Clinical trial inclusion criterion:
The participant has a diagnosis of Parkinson's disease according to the diagnostic criteria of the UK Parkinson's Disease Society Brain Bank.

Annotated entities:
- Condition: "Parkinson's disease"
- Measurement: "UK Parkinson's Disease Society Brain Bank"